Clinical trial exclusion criterion:
History of recent gastro-intestinal bleeding

Annotated entities:
- Condition: "gastro-intestinal bleeding"
- Temporal: "recent"